下列何者是腸內桿菌科（Enterobacteriaceae）病菌的共同特性？
A. 均為人體內的共生菌（normal flora）
B. 均具有氧化（oxidase）
C. 均能發酵葡萄糖
D. 均具有運動性

正確答案：C. 均能發酵葡萄糖